Clinical trial exclusion criterion:
Psychiatric disorders other than insomnia, PTSD and specific phobias; including bipolar and psychotic disorders and meeting criteria for DSM-5 moderate alcohol or drug use disorders within the past year.

Annotated entities:
- Condition: "Psychiatric disorders"
- Negation: "other"
- Condition: "insomnia"
- Condition: "PTSD"
- Condition: "phobias"
- Condition: "bipolar"
- Condition: "psychotic disorders"
- Temporal: "past year"
- Qualifier: "DSM-5"
- Qualifier: "moderate"
- Condition: "drug use disorders"
- Condition: "alcohol use disorders"